Clinical trial exclusion criterion:
Psychotic symptoms occurring at any time during the current major depressive episode.

Entity relations:
- AND("the current major depressive episode", "major depressive episode")
- Has_temporal("major depressive episode", "current")
- Has_index("at any time during the current major depressive episode", "the current major depressive episode")
- Has_temporal("Psychotic symptoms", "at any time during the current major depressive episode")